媽媽帶 5 歲的男童來求診，主訴半年前因肺炎住院時，意外發現男童有顯微性血尿（尿液分析：occult blood 2+, RBC：36-50/HPF）。之後他有幾次的尿液檢查都發現尿中有紅血球，但是她從未看過男童有紅尿或棕色尿。外婆、舅舅和奶奶都曾被檢驗出有血尿，但是家族中沒有人發生腎衰竭。下列何者是男童最有可能的診斷？
A. 家族性之 IgA 腎炎（IgA nephropathy）
B. 家族性之 Alport 徵候群（Alport syndrome）
C. 家族性之薄腎絲球基底膜徵候群（thin glomerular basement membrane disease）
D. 先天性之腎病徵候群（congenital nephrotic syndrome）

正確答案：C. 家族性之薄腎絲球基底膜徵候群（thin glomerular basement membrane disease）